Clinical trial exclusion criterion:
No serious neurological abnormalities due to LAL

Annotated entities:
- Negation: "No"
- Qualifier: "serious"
- Condition: "neurological abnormalities"
- Mood: "due to"
- Condition: "LAL"